Clinical trial exclusion criterion:
Abdominal and complex cervical cerclage (e.g. bulging bag)

Entity relations:
- Has_qualifier("cervical cerclage", "complex")
- Subsumes("complex", "bulging bag")
- Has_qualifier("cervical cerclage", "Abdominal")
- Subsumes("Abdominal", "bulging bag")